Clinical trial inclusion criterion:
Pregnant or lactating women.

Entity relations:
- OR("Pregnant", "lactating")